下列何種細胞素（cytokine）非屬於 proinflammatory cytokine？
A. TNF-α
B. IL-1
C. IL-8
D. IL-10

正確答案：D. IL-10